3. Infection with HIV.

The above is a clinical trial exclusion criterion. Annotated with entity spans:
3. [Condition: Infection with HIV].